Clinical trial exclusion criteria:
recent surgery (< 3 months)
previous chemotherapy
previous transfusion of blood products
neurodevelopmental disorders (including Trisomy 21)
supplemental oxygen requirement (< 3 months)
asthma requiring regular therapy
obstructive sleep apnea
the presence of concurrent infection or inflammation
a known allergy to dexmedetomidine hydrochloride

Annotated entities:
- Procedure: "surgery"
- Temporal: "recent"
- Temporal: "< 3 months"
- Temporal: "previous"
- Procedure: "chemotherapy"
- Temporal: "previous"
- Procedure: "transfusion of blood products"
- Condition: "neurodevelopmental disorders"
- Condition: "Trisomy 21"
- Procedure: "supplemental oxygen"
- Mood: "requirement"
- Temporal: "< 3 months"
- Condition: "asthma"
- Procedure: "regular therapy"
- Condition: "obstructive sleep apnea"
- Temporal: "concurrent"
- Condition: "infection"
- Condition: "inflammation"
- Condition: "allergy"
- Drug: "dexmedetomidine hydrochloride"